Clinical trial exclusion criterion:
Untreated symptomatic brain or leptomeningeal metastatic disease.

Entity relations:
- Has_qualifier("symptomatic leptomeningeal metastatic disease", "Untreated")
- Has_qualifier("symptomatic leptomeningeal metastatic disease", "Untreated")
- OR("symptomatic leptomeningeal metastatic disease", "symptomatic brain metastatic disease")